Clinical trial exclusion criterion:
Subjects who have used any drugs or substances known to inhibit or induce cytochrome (CYP) P450 enzymes and/or P-glycoprotein (P-gp) within 28 days prior to the first dose and throughout the study

Annotated entities:
- Drug: "drugs known to inhibit cytochrome (CYP) P450 enzymes"
- Drug: "drugs known to induce cytochrome (CYP) P450 enzymes"
- Drug: "drugs known to inhibit P-glycoprotein (P-gp)"
- Drug: "drugs known to induce P-glycoprotein (P-gp)"
- Temporal: "within 28 days prior to the first dose"
- Temporal: "throughout the study"